下列那個項目不是推動健康城市的特點？
A. 市政部門主導
B. 創新
C. 跨部門合作
D. 承諾健康

正確答案：A. 市政部門主導